Clinical trial inclusion criterion:
Trauma (including fractures)

Annotated entities:
- Condition: "Trauma"
- Condition: "fractures"